Clinical trial exclusion criterion:
Sufficiently socially unstable as to preclude participation (e.g. homeless)

Annotated entities:
- Condition: "socially unstable"
- Qualifier: "Sufficiently"